History of motion sickness or PONV

The above is a clinical trial exclusion criterion. Annotated with entity spans:
[Temporal: History] of [Condition: motion sickness] or [Condition: PONV]